Clinical trial exclusion criterion:
Use of any prescription drug or over-the-counter (OTC) medication which is prohibited by the protocol.

Entity relations:
- Has_qualifier("prescription drug", "prohibited by the protocol")
- OR("prescription drug", "over-the-counter (OTC) medication")